What is PRL3-zumab?

PRL3-zumab is a humanized monoclonal antibody specific for the epithelial-cell-associated phosphatase 3 (PRL-3) protein. It is approved for treatment of non-small cell lung carcinoma, adenocarcinoma of the stomach and gastroesophageal Junction, and recurrent glioblastoma.